Phase II: Patients must have histologically confirmed R/R NHL (as defined by WHO criteria). Patients with NHL other than diffuse large B cell lymphomas (DLBCL) must have received at least 2 prior therapies. Patients with DLBCL will be eligible if there is no available standard therapy.

The above is a clinical trial inclusion criterion. Annotated with entity spans:
Phase II: Patients must have [Measurement: histologically] [Value: confirmed] [Qualifier: R/R] [Condition: NHL] (as defined by [Measurement: WHO criteria]). Patients with [Condition: NHL] [Negation: other than] [Condition: diffuse large B cell lymphomas (DLBCL)] must have received [Multiplier: at least 2] [Temporal: prior] [Procedure: therapies]. Patients with [Condition: DLBCL] will be eligible if there is [Negation: no] available [Procedure: standard therapy].